Clinical trial inclusion criterion:
2. Male, 35-80 years; female, postmenopausal to 80 years;

Entity relations:
- Has_value("35-80 years", "35-80 years")
- Has_value("female", "to 80 years")
- Has_value("Male", "35-80 years")
- Has_value("postmenopausal", "to 80 years")
- OR("Male", "female")